Normal menstrual cycles: 25-34 days

The above is a clinical trial inclusion criterion. Annotated with entity spans:
[Condition: Normal menstrual cycles]: [Value: 25-34 days]